Clinical trial exclusion criterion:
Contraindications for medication abortion

Entity relations:
- AND("Contraindications", "medication abortion")